下列何種厭氧菌常存在正常人的下肢並引起糖尿病感染產氣性壞疽病（gas gangrene）？
A. Clostridium perfringens
B. Clostridium botulinum
C. Clostridium tetani
D. Clostridium difficile

正確答案：A. Clostridium perfringens